Clinical trial exclusion criterion:
For HCV-negative, healthy volunteers: History of HCV infection or positive HCV antibody test

Annotated entities:
- Measurement: "HCV"
- Value: "negative"
- Temporal: "History of HCV infection"